Las separaciones mediante electroferesis capilar de zona (CZE) se caracterizan porque el medio electroforético:
1. Está formado siempre por HCl 1.0 M.
2. Esta formado siempre por NH3 1.0 M.
3. Es homogéneo a lo largo de todo el capilar.
4. No es homogéneo a lo largo de todo el capilar.
5. Tiene un gradiente de pH a lo largo de todo el capilar.

Respuesta correcta: 3. Es homogéneo a lo largo de todo el capilar.